HIV/HCV co-infected subjects (n=12) must also have a HIV RNA measurement <50 copies/mL at the pre-treatment visit.

The above is a clinical trial inclusion criterion. Annotated with entity spans:
[Condition: HIV]/[Condition: HCV] [Condition: co-infected] subjects (n=12) must also have a [Measurement: HIV RNA measurement] [Value: <50 copies/mL] [Temporal: at the pre-treatment visit].